History of gastrointestinal malabsorption or gastric bypass surgery

The above is a clinical trial exclusion criterion. Annotated with entity spans:
History of [Condition: gastrointestinal malabsorption] or [Procedure: gastric bypass surgery]